Clinical trial exclusion criterion:
6. A platelet count less than 75,000 cells/mm3 or greater than 700,000 cells/mm3 or a WBC less than 3,000 cells/mm3.

Annotated entities:
- Measurement: "platelet count"
- Value: "less than 75,000 cells/mm3"
- Value: "greater than 700,000 cells/mm3"
- Measurement: "WBC"
- Value: "less than 3,000 cells/mm3"